Clinical trial exclusion criterion:
Subject with a diagnosis of gastroparesis or small bowel or large bowel dysmotility.

Annotated entities:
- Condition: "gastroparesis"
- Condition: "small bowel"
- Condition: "large bowel dysmotility"